History of steroid or immunosuppressive drug use within 6 months of surgery

The above is a clinical trial exclusion criterion. Annotated with entity spans:
History of [Drug: steroid] or [Drug: immunosuppressive drug] use [Temporal: within 6 months of surgery]